heavy calcification.

The above is a clinical trial exclusion criterion. Annotated with entity spans:
[Qualifier: heavy] [Condition: calcification].